Clinical trial exclusion criterion:
Subject with a history of a positive test for Hepatitis B surface antigen (HbsAg) or Hepatitis C

Annotated entities:
- Temporal: "history of"
- Value: "positive"
- Measurement: "test for Hepatitis B surface antigen (HbsAg)"
- Measurement: "test for Hepatitis C"